下列何種情況會增加肺順應性（lung compliance）？
A. 表面作用素（surfactant）分泌減少
B. 肺纖維化（fibrosis）
C. 肺水腫（lung edema）
D. 肺氣腫（emphysema）

正確答案：D. 肺氣腫（emphysema）